Clinical trial exclusion criterion:
Malabsorptive GI disease, such as celiac disease, or gastric bypass

Entity relations:
- Subsumes("Malabsorptive GI disease", "celiac disease")
- OR("celiac disease", "gastric bypass")